Clinical trial inclusion criterion:
Patients with angina or silent ischemia and documented ischemia

Entity relations:
- Has_qualifier("ischemia", "silent")
- Has_qualifier("ischemia", "documented")
- OR("angina", "ischemia", "ischemia")